Ivabradine用以治療心搏過速，且不影響心肌收縮力、心室再極化和心內傳導，其作用機制為何？
A. funny current（If）blocker
B. L-Type calcium channel blocker
C. T-Type calcium channel blocker
D. beta blocker

正確答案：A. funny current（If）blocker